Clinical trial exclusion criterion:
Lactating females.

Annotated entities:
- Person: "females"
- Condition: "Lactating"